關於鼻腔血管纖維瘤（angiofibroma）的敘述，下列何者正確？
A. 最常發生在中老年男性
B. 一般相信是從鼻腔後側壁的富含纖維血管的間質長出來的
C. 是造成鼻腔中隔壞死性潰瘍最常見的原因
D. 屬良性腫瘤，不會復發或造成病患死亡

正確答案：B. 一般相信是從鼻腔後側壁的富含纖維血管的間質長出來的